Clinical trial exclusion criterion:
Patients with a prior serious hypersensitivity reaction to liraglutide

Annotated entities:
- Condition: "hypersensitivity reaction"
- Drug: "liraglutide"
- Temporal: "prior"
- Qualifier: "serious"